Clinical trial inclusion criterion:
Not pregnant for female subjects.

Annotated entities:
- Negation: "Not"
- Condition: "pregnant"
- Person: "female"